Clinical trial exclusion criterion:
Magnetic metallic implants (such as screws, pins, shrapnel remnants, aneurysm clips, artificial heart valves, inner ear (cochlear) implants, artificial joints, and vascular stents)

Annotated entities:
- Device: "Magnetic metallic implants"
- Device: "screws"
- Device: "pins"
- Device: "shrapnel remnants"
- Device: "aneurysm clips"
- Device: "artificial heart valves"
- Device: "inner ear implants"
- Device: "cochlear implants"
- Device: "artificial joints"
- Device: "vascular stents"